下列那種問題最不會造成膀胱過動症（overactive bladder）？
A. 腦中風
B. 良性前列腺肥大症
C. 子宮頸癌接受根除性切除手術
D. 胸椎損傷造成膀胱功能損傷

正確答案：C. 子宮頸癌接受根除性切除手術